Clinical trial exclusion criteria:
not diabetic patient;
patients in dual antiplatelet therapy;
patient with severe renal failure;
patient poor responders

Annotated entities:
- Condition: "diabetic"
- Negation: "not"
- Procedure: "dual antiplatelet therapy"
- Condition: "renal failure"
- Qualifier: "severe"
- Condition: "poor responders"